Which molecule is targeted by Fenebrutinib?

Fenebrutinib is a noncovalent, oral, and highly selective inhibitor of Bruton's tyrosine kinase (BTK).